6. Total occluded vessels. One total occluded major epicardial vessel or side branch can be included and targeted as long as one other major vessel has a significant stenosis amenable for SA, provided the age of occlusion is less than one month e.g. recent instability, infarction with ECG changes in the area subtended by the occluded vessel. Patients with total occluded vessels of unknown duration or existing longer than one month and a reference over 1.50 mm should not be included, not even as a third or fourth vessel to be dilated;

The above is a clinical trial inclusion criterion. Annotated with entity spans:
6. [Condition: Total occluded vessels]. [Multiplier: One] [Condition: total occluded major epicardial vessel] or side branch can be included and targeted as long as one other major vessel has a significant stenosis amenable for SA, provided the age of occlusion is less than one month e.g. recent instability, infarction with ECG changes in the area subtended by the occluded vessel. Patients with [Condition: total occluded vessels] of [Temporal: unknown duration] or existing [Temporal: longer than one month] and a [Measurement: reference] [Value: over 1.50 mm] should not be included, not even as a third or fourth vessel to be dilated;